有關女性乳房纖維性腺瘤（fibroadenoma）的敘述，下列何者錯誤？
A. 其腫瘤大小常見為 1 或 2 公分
B. 常見於 15 至 25 歲年輕女性
C. 多發性的纖維性腺瘤並非少見
D. 由於常會導致乳癌，故一定要切除

正確答案：D. 由於常會導致乳癌，故一定要切除